有關腸	疊（intussusception）之敘述，下列何者錯誤？
A. 常見的好發年齡，介於六個月至一歲
B. 絕大部分病童，可以找出lead point
C. 最好發的腸段是迴結腸（ileocolic）處
D. 典型的症狀，為腹痛、腹部腫塊與血便

正確答案：B. 絕大部分病童，可以找出lead point